CD28 與 CTLA-4 為調控 CD4+ T 細胞活化的重要分子，下列有關 CD28 與 CTLA-4 之敘述，何者正確？
A. CD28 與 CTLA-4 皆會表現在純真（naïve）CD4+ T 細胞上
B. CD28 與 CTLA-4 分子皆會與 B7 分子結合，但是 CD28 與 B7 的親和力高於 CTLA-4 與 B7 的親和力
C. CD28 傳遞活化的訊息給 CD4+ T 細胞，但是 CTLA-4 傳遞抑制活化的訊息給 CD4+ T 細胞
D. CTLA-4 對於維持中央耐受性（central tolerance）扮演重要角色

正確答案：C. CD28 傳遞活化的訊息給 CD4+ T 細胞，但是 CTLA-4 傳遞抑制活化的訊息給 CD4+ T 細胞